patent foramen ovale with atrial septal aneurysm

The above is a clinical trial exclusion criterion. Annotated with entity spans:
[Condition: patent foramen ovale] with [Condition: atrial septal aneurysm]